一位 28 歲孕婦，G2P1，妊娠 25 週，先前於妊娠 24 週時接受 50 克葡萄糖耐受性試驗（50-g oral glucose  tolerance test, 50-g OGTT），被判為異常，必須接受進一步檢查。則 50-g OGTT 血糖值多少 mg/dL 以上判為異常？
A. 110
B. 120
C. 125
D. 140

正確答案：D. 140